Clinical trial inclusion criterion:
The treating physician has chosen Ventavis as a suitable long-term treatment for the patient

Annotated entities:
- Drug: "Ventavis"
- Multiplier: "long-term"